一位 52 歲女性不慎跌倒，經檢查後證實發生橈骨遠端骨折（Colles 氏骨折），經包上臂石膏之治療後，病患情況良好，手指活動正常；但至第六週時，突然不能主動伸展大拇指，但被動活動並無限制。下列何種可能性最大？
A. 發生 Sudeck 氏反射性交感神經性失養症
B. 伸拇長肌肌腱斷裂
C. 拇指的基部關節脫位
D. 骨折失去復位

正確答案：B. 伸拇長肌肌腱斷裂